Clinical trial exclusion criterion:
Autoimmune corneal ulcer

Entity relations:
- Has_qualifier("corneal ulcer", "Autoimmune")